Clinical trial exclusion criterion:
Psychological, social, familial, or geographical reasons that would prevent regular follow-up

Annotated entities:
- Non-query-able: "Psychological, social, familial, or geographical reasons that would prevent regular follow-up"